Clinical trial exclusion criterion:
4. The Principal Investigator deems any clinical laboratory test (at the Screening Visit) abnormality to be clinically significant

Annotated entities:
- Subjective_judgement: "The Principal Investigator deems any clinical laboratory test (at the Screening Visit) abnormality to be clinically significant"